病患經過處理之後狀況逐漸改善，不幸的是，在術後五天之後又再度高燒不退，下列處置何者錯誤？
A. 血球檢查、胸部X光、尿液分析和血液培養
B. 若懷疑是導管相關感染，拔掉導管同時並給予vancomycin 或是linezolid
C. 假如懷疑是心內膜炎（endocarditis），至少要給予抗生素四到六週
D. 若是嚴重的	血症或是免疫抑制（immunosuppression）的病人，抗生素藥效須涵蓋gram-positive cocci和 fungus

正確答案：D. 若是嚴重的	血症或是免疫抑制（immunosuppression）的病人，抗生素藥效須涵蓋gram-positive cocci和 fungus